下列有關尿路感染的敘述何者錯誤？
A. 最常見的致病菌是 O 血清型大腸菌（O-serogroups E. coli）
B. 腎盂腎炎最常見的感染途徑是膀胱內細菌經輸尿管至腎臟
C. 尿液分析是快速篩檢尿路感染的方法
D. 尿液細菌培養出細菌，即可確定尿路感染

正確答案：D. 尿液細菌培養出細菌，即可確定尿路感染